American Society of Anesthesiologists risk classification I and II

The above is a clinical trial inclusion criterion. Annotated with entity spans:
[Measurement: American Society of Anesthesiologists risk classification] [Value: I and II]